Cuál de los siguientes fármacos NO se utiliza para el tratamiento de los síntomas psicóticos de la esquizofrenia:
1. Olanzapina (Zyprexa).
2. Risperidona (Risperdal).
3. Aripripazol (Abilify).
4. Clozapina (Leponex).
5. Venlafaxina (Dobupal, Vandral).

Respuesta correcta: 5. Venlafaxina (Dobupal, Vandral).